Clinical trial exclusion criterion:
Females of childbearing potential who are pregnant, breast-feeding or intend to become pregnant or are not using adequate contraceptive methods

Annotated entities:
- Condition: "childbearing potential"
- Person: "Females"
- Condition: "pregnant"
- Condition: "breast-feeding"
- Condition: "pregnant"
- Mood: "intend to become"
- Procedure: "contraceptive methods"
- Qualifier: "adequate"
- Negation: "not"
- Pregnancy_considerations: "Females of childbearing potential who are pregnant, breast-feeding or intend to become pregnant or are not using adequate contraceptive methods"